What is Nextflow?

Nextflow is a flow management framework that uses container technology to ensure efficient deployment and reproducibility of computational analysis pipelines.